delirious state at presentation in the ED

The above is a clinical trial exclusion criterion. Annotated with entity spans:
[Condition: delirious] state at presentation in the ED